Clinical trial inclusion criterion:
Signed written informed consent.

Annotated entities:
- Post-eligibility: "Signed written informed consent"